Clinical trial exclusion criterion:
Person who is pregnant.

Annotated entities:
- Condition: "pregnant"